Plan to remain in study area greater than 6 months

The above is a clinical trial inclusion criterion. Annotated with entity spans:
[Mood: Plan] to [Observation: remain in study area] [Temporal: greater than 6 months]